Los resultados de la evaluación de un programa de prevención realizada en un contexto, entorno y población concreto, se refieren al concepto de:
1. Efectividad.
2. Eficiencia.
3. Eficacia.
4. Factibilidad.
5. Sostenibilidad.

Respuesta correcta: 1. Efectividad.